Clinical trial exclusion criterion:
Subject has any history of previous transient ischemic attack or stroke.

Entity relations:
- OR("transient ischemic attack", "stroke")